Clinical trial exclusion criterion:
acute illness at screening or randomization according to judgement by the investigator or patient

Annotated entities:
- Non-query-able: "acute illness at screening or randomization according to judgement by the investigator or patient"